Clinical trial exclusion criterion:
Major fetal defects

Annotated entities:
- Condition: "Major fetal defects"